有關公共衛生、基層醫療、尖端醫療科技三者之關係密切，相互影響，從國民健康投資報酬率的觀點，下列三者之關係，何者最正確？
A. 公共衛生＞基層醫療＞尖端醫療科技
B. 基層醫療＞公共衛生＝尖端醫療科技
C. 尖端醫療科技＞基層醫療＞公共衛生
D. 基層醫療＝公共衛生＝尖端醫療科技

正確答案：A. 公共衛生＞基層醫療＞尖端醫療科技